Clinical trial inclusion criterion:
Systemically healthy adults.

Annotated entities:
- Qualifier: "Systemically"
- Condition: "healthy"
- Person: "adults"